下列各種與癌症形成有關的基因中，何者並非轉錄因子（transcription factor）基因？
A. c-myc
B. p53
C. bcl-2
D. 以上皆為轉錄因子基因

正確答案：C. bcl-2